Weight >5kg

The above is a clinical trial inclusion criterion. Annotated with entity spans:
[Person: Weight] [Value: >5kg]